Clinical trial inclusion criterion:
Male or female, aged = 18 to = 60 years on day of inclusion.

Annotated entities:
- Person: "Male"
- Person: "female"
- Person: "aged"
- Value: "= 18 to = 60 years"
- Temporal: "on day of inclusion"